Clinical trial exclusion criterion:
Active bleeding, bleeding diathesis.

Entity relations:
- Has_qualifier("bleeding", "Active")
- OR("bleeding", "bleeding diathesis")